Clinical trial exclusion criterion:
Previous diagnosis of collagen disorder

Annotated entities:
- Condition: "collagen disorder"